Clinical trial exclusion criterion:
History of hypersensitivity reactions to murine protein-containing products.

Entity relations:
- AND("hypersensitivity reactions", "murine protein-containing products")
- AND("murine protein-containing products", "murine")